4 歲男孩因雙眼視力慢慢變差，經檢查發現兩側眼底均有腫瘤，手術切除後，病理診斷為惡性腫瘤，請問該病人發生第二種相關癌症的機率，以下列何者最高？
A. hepatoblastoma
B. neuroblastoma
C. Wilms' tumor
D. osteogenic sarcoma

正確答案：D. osteogenic sarcoma